Clinical trial inclusion criterion:
8) provision of informed consent. In addition, all subjects who meet criteria for the training portion must complete an exercise tolerance test and be cleared for participation by the study cardiologist.

Annotated entities:
- Non-query-able: "provision of informed consent."
- Post-eligibility: "In addition, all subjects who meet criteria for the training portion must complete an exercise tolerance test and be cleared for participation by the study cardiologist."
- Parsing_Error: "8)"